Clinical trial inclusion criterion:
Subjects completed PEAK can be included if their treatment is the same as randomized even after 30 days of End Of the Study.

Annotated entities:
- Post-eligibility: "Subjects completed PEAK can be included if their treatment is the same as randomized even after 30 days of End Of the Study"